Clinical trial exclusion criterion:
Consecutive fibrinolytic states to coagulopathy

Annotated entities:
- Condition: "fibrinolytic states"
- Condition: "coagulopathy"